Clinical trial exclusion criterion:
Initiation or change of dosage of bosentan, sildenafil or calcium channel blockers in the previous month or in the following month

Annotated entities:
- Drug: "bosentan"
- Drug: "sildenafil"
- Drug: "calcium channel blockers"
- Temporal: "in the previous month"
- Temporal: "in the following month"